Clinical trial inclusion criterion:
Patient must be 18 years or older

Entity relations:
- Has_value("years", "18 or older")